Clinical trial exclusion criterion:
History of cancer in the preceding 2 years other than successfully treated, non-metastatic, squamous cell or basal cell carcinoma, or cervical cancer in situ.

Entity relations:
- Has_temporal("cancer", "preceding 2 years")
- Has_qualifier("basal cell carcinoma", "non-metastatic")
- Has_qualifier("basal cell carcinoma", "successfully treated")
- Has_negation("basal cell carcinoma", "other")
- OR("basal cell carcinoma", "carcinoma squamous cell", "cervical cancer in situ")